一般所謂巧克力囊腫（chocolate cyst）是特指發生於何處之內膜異位症？
A. 膀胱
B. 卵巢
C. 直腸
D. 子宮

正確答案：B. 卵巢